Clinical trial inclusion criterion:
Age 19 and more

Annotated entities:
- Person: "Age"
- Value: "19 and more"